Clinical trial inclusion criterion:
Lack of participation in another clinical study,

Annotated entities:
- Negation: "Lack of"
- Observation: "participation in clinical study"
- Qualifier: "another"